Clinical trial exclusion criterion:
Myocardial infarction and heart surgery up to three months before the survey;

Entity relations:
- Has_temporal("Myocardial infarction", "up to three months before the survey")
- OR("Myocardial infarction", "heart surgery")